What is Progeria?

Progeria is a genetic disorder that causes premature aging and early death in the first or second decade of life, usually secondary cardiovascular events (myocardial infarction and stroke).